Clinical trial exclusion criterion:
Patient who is HbsAg negative has received an HbsAg positive (HBV DNA by PCR or HBV antibody) donor liver

Entity relations:
- Has_value("HbsAg", "negative")
- AND("PCR", "HBV DNA")
- Has_qualifier("donor", "liver")
- Has_value("HbsAg", "positive")
- Subsumes("HbsAg", "PCR")
- OR("PCR", "HBV antibody")